M2 or M3 marrow on day 33

The above is a clinical trial inclusion criterion. Annotated with entity spans:
[Line: M2 or M3 marrow on day 33]